一位 38 歲酒精脫癮患者因脫癮癲癇（withdrawal seizures）發作，而被送至急診室，你是急診醫師，應以下列何種方式處置？
A. Lorazepam, Oral, 2-10 mg q4h
B. Diazepam, Oral, 5-20 mg q4h
C. Chlordiazepoxide, I. V., 0.15 mg/kg at 12.5 mg/min
D. Diazepam, I. V., 0.15 mg/kg at 2.5 mg/min

正確答案：D. Diazepam, I. V., 0.15 mg/kg at 2.5 mg/min